Clinical trial inclusion criterion:
Currently residing in Manitoba

Annotated entities:
- Visit: "Manitoba"
- Observation: "Currently residing"